17歲男生，因為最近2週內體重增加10公斤且出現水腫狀況而求診，身體診察時發現下肢有按壓性水腫，尿液檢查發現有嚴重蛋白尿(3+)、白血球：20/HPF，血液檢查發現白蛋白低下：1.6 g/dL、膽固醇上升：425 mg/dL和三酸甘油酯上升300 mg/dL，下列何者為最有可能的診斷？
A. 腎病症候群
B. 急性腎炎
C. 泌尿道感染
D. 擴張性心肌病變

正確答案：A. 腎病症候群